Adenocarcinoma of low or moderate differentiation

The above is a clinical trial inclusion criterion. Annotated with entity spans:
[Condition: Adenocarcinoma] of [Qualifier: low or moderate differentiation]